若某物質 X 可被濾出，其血漿中的濃度與腎絲球過濾率（glomerular filtration rate）的乘積大於尿中濃度與每分鐘尿量的乘積，則下列何者為腎小管對此物質的作用？
A. 重吸收作用大於分泌作用
B. 幾乎不進行重吸收作用
C. 重吸收作用等於分泌作用
D. 分泌作用大於重吸收作用

正確答案：A. 重吸收作用大於分泌作用